Clinical trial inclusion criterion:
Patients who meet 1987 ACR criteria for SLE with 1996 modifications

Entity relations:
- AND("SLE", "1987 ACR criteria with 1996 modifications")